What is another name for bimagrumab

Bimagrumab also goes by the name BYM338.